Señalar la respuesta FALSA en la elaboración de supositorios:
1. Los excipientes hidrófilos no presentan problemas de conservación a temperaturas elevadas.
2. Los excipientes de glicerina contienen habitualmente un 20% de glicerina y un 80% de gelatina.
3. El poder irritante de los polietilenglicoles utilizados pueden reducirse con la incorporación de un 20% de agua a la masa.
4. Los supositorios elaborados con polietilenglicol pueden resultar frágiles especialmente cuando llevan agua incorporada.

Respuesta correcta: 2. Los excipientes de glicerina contienen habitualmente un 20% de glicerina y un 80% de gelatina.